Contraindication for IR-MPH use

The above is a clinical trial exclusion criterion. Annotated with entity spans:
[Condition: Contraindication] for [Drug: IR-MPH] use